Clinical trial exclusion criterion:
Age less than one year or age greater than/equals to 18 years

Entity relations:
- Has_value("age", "greater than/equals to 18 years")
- Has_value("Age", "less than one year")
- OR("Age", "age")